Clinical trial inclusion criterion:
Progression on or failure to respond to at least one previous chemotherapy regimen for metastatic disease

Annotated entities:
- Observation: "failure to respond"
- Observation: "Progression on"
- Temporal: "previous"
- Procedure: "chemotherapy regimen"
- Condition: "metastatic disease"